Clinical trial inclusion criterion:
Patients must have a calculated serum creatinine clearance > 50 mL/min using Cockcroft-Gault calculation or based on 24-hour urine collection performed within 7 days prior to treatment.

Annotated entities:
- Measurement: "serum creatinine clearance"
- Value: "> 50 mL/min"
- Qualifier: "Cockcroft-Gault calculation"
- Qualifier: "24-hour urine collection"
- Temporal: "within 7 days prior"
- Reference_point: "treatment"